Clinical trial exclusion criterion:
Strenuous physical exercise within 3 hours of Visit 1 (Screening)

Annotated entities:
- Condition: "Strenuous physical exercise"
- Temporal: "within 3 hours of Visit 1 (Screening)"
- Reference_point: "Visit 1 (Screening)"